Clinical trial exclusion criterion:
uncontrolled diabetes,

Entity relations:
- Has_qualifier("diabetes", "uncontrolled")